Serious cardiac dysfunction, hypertension, or hematological disorder.

The above is a clinical trial exclusion criterion. Annotated with entity spans:
[Qualifier: Serious] [Condition: cardiac dysfunction], [Condition: hypertension], or [Condition: hematological disorder].